排除病患年齡因素，現今一般共識認為成人異體造血幹細胞移植（allogeneic hematopoietic stem cell transplantation）最不符合優先治療適應症（indication）者為何？
A. 嚴重型再生不良性貧血（severe aplastic anemia）
B. 急性骨髓性白血病第二次緩解期（acute myeloid leukemia in 2nd remission）
C. 急性淋巴性白血病第一次緩解期（acute lymphoid leukemia in 1st remission）
D. 新診斷之費城染色體陽性慢性骨髓性白血病慢性期（Ph-positive chronic myeloid leukemia in chronic phase）

正確答案：D. 新診斷之費城染色體陽性慢性骨髓性白血病慢性期（Ph-positive chronic myeloid leukemia in chronic phase）